Clinical trial exclusion criterion:
Non-cirrhotic portal hypertension causing esophageal varices

Entity relations:
- AND("Non-cirrhotic portal hypertension", "esophageal varices")